cT4

The above is a clinical trial exclusion criterion. Annotated with entity spans:
[Condition: cT4]